Clinical trial exclusion criterion:
Active uncontrolled infection requiring antibiotics.

Entity relations:
- Has_qualifier("infection", "Active uncontrolled")
- AND("infection", "antibiotics")